4. Anticonvulsants: carbamazepine, phenytoin, phenobarbital

The above is a clinical trial exclusion criterion. Annotated with entity spans:
[Parsing_Error: 4.] Anticonvulsants: [Drug: carbamazepine], [Drug: phenytoin], [Drug: phenobarbital]